下列那一種新生兒染色體異常發生率最高？
A. Trisomy 21
B. Trisomy 18
C. Trisomy 13
D. 45,X

正確答案：A. Trisomy 21